Patient is able and willing to follow protocol requirements.

The above is a clinical trial inclusion criterion. Annotated with entity spans:
[Post-eligibility: Patient is able and willing to follow protocol requirements].